Clinical trial exclusion criterion:
Known to be hypersensitivity to Bisoprolol, or any of the excipient.

Entity relations:
- Has_qualifier("excipient", "any")
- AND("hypersensitivity", "Bisoprolol")
- OR("Bisoprolol", "excipient")